Clinical trial inclusion criterion:
Histologically proven recurrent or persistent endometrial cancer that is not amenable to curative treatment with surgery and/or radiation therapy AND has failed 2 previous treatment regimens

Entity relations:
- Has_value("Histologically", "proven")
- AND("endometrial cancer", "Histologically")
- Has_qualifier("endometrial cancer", "amenable to curative treatment")
- Has_negation("amenable to curative treatment", "not")
- AND("amenable to curative treatment", "surgery")
- AND("2", "treatment regimens")
- Has_temporal("treatment regimens", "previous")
- Has_context("treatment regimens", "failed")
- AND("treatment regimens", "endometrial cancer")
- Has_qualifier("endometrial cancer", "recurrent")
- OR("surgery", "radiation therapy")
- OR("recurrent", "persistent")